21. Transaminases (alanine transaminase, aspartate transaminase) levels >3 × upper limit of normal (ULN) and/or bilirubin level >2 × ULN.

The above is a clinical trial exclusion criterion. Annotated with entity spans:
[Parsing_Error: 21.] [Measurement: Transaminases] ([Measurement: alanine transaminase], [Measurement: aspartate transaminase]) levels [Value: >3 × upper limit of normal (ULN)] and/or [Measurement: bilirubin level] [Value: >2 × ULN].